Clinical trial exclusion criterion:
Prior spontaneous preterm birth or second trimester losses between 16(0) and 36(6) weeks

Entity relations:
- Has_qualifier("losses", "between 16(0) and 36(6) weeks")
- Has_qualifier("losses", "second trimester")
- Has_temporal("spontaneous preterm birth", "Prior")
- OR("spontaneous preterm birth", "losses")